Clinical trial exclusion criterion:
alanine aminotransferase (ALT), aspartase aminotransferase (AST), or alkaline phosphatase = 10 times upper limit of normal(ULN)

Entity relations:
- Subsumes("alanine aminotransferase", "ALT")
- Subsumes("aspartase aminotransferase", "AST")
- Has_value("alanine aminotransferase", "= 10 times upper limit of normal")
- OR("alanine aminotransferase", "aspartase aminotransferase", "alkaline phosphatase")